Smoking history > 10 packs/year

The above is a clinical trial inclusion criterion. Annotated with entity spans:
[Measurement: Smoking history] [Value: > 10 packs/year]